Clinical trial exclusion criterion:
History of seizures within last 10 years

Entity relations:
- Has_temporal("seizures", "within last 10 years")